End of last exacerbation less than 6 weeks prior to screening/re-screening visit.

The above is a clinical trial exclusion criterion. Annotated with entity spans:
End of last [Condition: exacerbation] [Temporal: less than 6 weeks prior to screening/re-screening visit].